Clinical trial exclusion criterion:
Beta-lactam allergy

Entity relations:
- AND("allergy", "Beta-lactam")